Clinical trial exclusion criterion:
Patients who are anticipated to receive treatment or surgery that may require desisting the administration of antiplatelet therapy for 2 weeks or longer during the period of the clinical trial

Entity relations:
- Has_mood("treatment", "anticipated to")
- AND("treatment", "antiplatelet therapy")
- Has_temporal("antiplatelet therapy", "for 2 weeks or longer")
- OR("treatment", "surgery")